3. Must have baseline bone marrow sample taken.

The above is a clinical trial inclusion criterion. Annotated with entity spans:
3. Must have [Temporal: baseline] [Procedure: bone marrow sample] taken.